10天大男嬰被發現心跳過快。心電圖顯示窄QRS波，心跳每分鐘220次，P波不明顯。下列何者處置最不適當？
A. 可先嘗試刺激迷走神經治療
B. 可先給予靜脈注射adenosine
C. 首選給予靜脈注射verapamil
D. 生命徵象穩定，給予同步電擊（DC cardioversion）

正確答案：C. 首選給予靜脈注射verapamil